Clinical trial inclusion criterion:
Lesion length = 40

Entity relations:
- Has_value("Lesion length", "= 40")